What is a ciliopathy?

Ciliopathies are a group of disorders caused by a defect in ciliogenesis, ciliary protein trafficking.